Patient has an IPSS score of at least 13 at baseline

The above is a clinical trial inclusion criterion. Annotated with entity spans:
Patient has an [Measurement: IPSS score] of [Value: at least 13] [Temporal: at baseline]